patients in therapy with anticoagulants or antiaggregants;

The above is a clinical trial exclusion criterion. Annotated with entity spans:
patients in [Procedure: therapy] with [Drug: anticoagulants] or [Drug: antiaggregants];